Indique la respuesta FALSA respecto al bisfenol A:
1. Es un componente del plástico con el que se fabrican biberones, juguetes y envases para comida.
2. Es un disruptor endocrino.
3. Desmieliniza el nervio óptico.
4. Tiene actividad estrogénica.

Respuesta correcta: 3. Desmieliniza el nervio óptico.